Subject has 2° type II, 3° degree AV-block or left/right bundle branch block pattern.

The above is a clinical trial exclusion criterion. Annotated with entity spans:
Subject has [Condition: 2° type II], [Condition: 3° degree AV-block] or [Condition: left]/[Condition: right bundle branch block] pattern.